一位 52 歲婦女因 3 年前小針注射隆乳（free silicon injection）後，最近覺得有硬塊來求診，下列何種檢查最不適宜？
A. 超音波
B. 乳房攝影
C. 磁振影像（MRI）
D. 細針抹片

正確答案：B. 乳房攝影